DSM-IV diagnosis of Alcohol or Substance Dependence within the last six months (except nicotine) or DSM-5 diagnosis of Substance Use Disorder in the last six months (except nicotine)

The above is a clinical trial exclusion criterion. Annotated with entity spans:
[Qualifier: DSM-IV] diagnosis of [Condition: Alcohol] or [Condition: Substance Dependence] [Temporal: within the last six months] ([Negation: except] [Drug: nicotine]) or [Qualifier: DSM-5] diagnosis of [Condition: Substance Use Disorder] [Temporal: in the last six months] ([Negation: except] [Drug: nicotine])